Clinical trial exclusion criterion:
Other CNS conditions: non-opportunistic primary or metastatic brain tumors, uncontrolled seizure disorder, progressive multiple sclerosis, stroke with neurological sequelae, or dementia due to causes other than HIV (eg, Alzheimer's disease)

Annotated entities:
- Qualifier: "Other"
- Condition: "CNS conditions"
- Qualifier: "non-opportunistic"
- Qualifier: "primary"
- Qualifier: "metastatic"
- Condition: "brain tumors"
- Qualifier: "uncontrolled"
- Condition: "seizure disorder"
- Condition: "progressive multiple sclerosis"
- Condition: "stroke"
- Condition: "neurological sequelae"
- Condition: "dementia"
- Negation: "other than"
- Condition: "HIV"
- Condition: "Alzheimer's disease"